Clinical trial exclusion criterion:
Osteoporosis or major risk for bone fractures.

Annotated entities:
- Condition: "Osteoporosis"
- Mood: "major risk"
- Condition: "bone fractures"